Clinical trial exclusion criterion:
Female subjects taking hormonal contraceptives or hormone replacement therapy may be included in this study only if they have been on a stable dose for at least 3 months.

Entity relations:
- Has_temporal("stable dose", "for at least 3 months")
- Has_qualifier("hormonal contraceptives", "stable dose")
- OR("hormonal contraceptives", "hormone replacement therapy")